Clinical trial exclusion criterion:
Participant has a clinically significant abnormal physical examination, vital signs or 12 lead ECG (including QTc greater than (>) 450msec, Left Bundle Branch Block, permanent pacemaker or implantable cardioverter defibrillator) at Screening or admission

Annotated entities:
- Undefined_semantics: "clinically significant"
- Qualifier: "clinically significant"
- Condition: "abnormal physical examination"
- Undefined_semantics: "abnormal physical examination"
- Condition: "abnormal vital signs"
- Condition: "abnormal 12 lead ECG"
- Measurement: "QTc"
- Value: "greater than (>) 450msec"
- Condition: "Left Bundle Branch Block"
- Device: "permanent pacemaker"
- Condition: "implantable cardioverter defibrillator"
- Temporal: "at Screening or admission"
- Reference_point: "Screening"
- Reference_point: "admission"